Clinical trial inclusion criteria:
Adult participants with low or intermediate-1 risk MDS
No previous treatment with hematopoietic growth factors within 3 months prior to screening
Symptomatic anemia (hemoglobin <10 g/dL) as determined by investigator
Serum erythropoietin <500 milliunits/milliliter (mU/mL) within 14 days prior to the first dose of study treatment
Require no red blood cell transfusion or dependent on <4 units within 8 weeks prior to screening
Clinically stable for at least 1 month prior to entry into the study
For female participants of childbearing potential and male participants with partners of childbearing potential, agreement (by participants and/or partner) to use highly effective form(s) of contraception

Annotated entities:
- Person: "Adult"
- Measurement: "MDS"
- Value: "intermediate-1 risk"
- Value: "low risk"
- Drug: "hematopoietic growth factors"
- Temporal: "within 3 months prior to screening"
- Reference_point: "screening"
- Condition: "anemia"
- Qualifier: "Symptomatic"
- Measurement: "hemoglobin"
- Value: "<10 g/dL"
- Measurement: "Serum erythropoietin"
- Value: "<500 milliunits/milliliter"
- Temporal: "within 14 days prior to the first dose of study treatment"
- Procedure: "red blood cell transfusion"
- Negation: "no"
- Multiplier: "<4 units"
- Temporal: "within 8 weeks prior to screening"
- Condition: "stable"
- Temporal: "for at least 1 month prior to entry into the study"
- Reference_point: "entry into the study"
- Pregnancy_considerations: "For female participants of childbearing potential and male participants with partners of childbearing potential, agreement (by participants and/or partner) to use highly effective form(s) of contraception"